En cuánto a la altura del plato (H) en una separación cromatográfica en columna se puede decir que:
1. Es inversamente proporcional a la varianza (desviación estándar de la banda).
2. Es directamente proporcional al número de platos teóricos e inversamente proporcional a la longitud de la columna.
3. Es directamente proporcional a la varianza e inversamente proporcional a la distancia recorrida por el centro de la banda hasta el detector (L).
4. Es directamente proporcional a la varianza y a la distancia recorrida por el centro de la banda hasta el detector (L).
5. No depende de la varianza ni de la distancia recorrida por el centro de la banda.

Respuesta correcta: 3. Es directamente proporcional a la varianza e inversamente proporcional a la distancia recorrida por el centro de la banda hasta el detector (L).